Describe meCLICK-Seq

The meCLICK-Seq (methylation CLICK-degradation Sequencing) is a method to identify RNA modification substrates with high resolution at intronic and intergenic regions. It hijacks RNA methyltransferase activity to introduce an alkyne, instead of a methyl, moiety on RNA.